Clinical trial inclusion criterion:
> 18 years old

Entity relations:
- Has_value("old", "18 years")